Clinical trial exclusion criterion:
Subject requires uni or bilateral facetectomy to treat leg/back pain.

Annotated entities:
- Qualifier: "bilateral"
- Procedure: "facetectomy"
- Qualifier: "uni"
- Condition: "back pain"
- Condition: "pain leg"